Clinical trial exclusion criterion:
inability to tolerate procedure due to hemodynamic instability or severe hypoxemia;

Entity relations:
- AND("inability to tolerate", "procedure")
- Has_qualifier("hypoxemia", "severe")
- AND("inability to tolerate", "hemodynamic instability")
- OR("hemodynamic instability", "hypoxemia")